Clinical trial exclusion criterion:
Patients with thrombosis within the hepatic, portal, or mesenteric veins.

Annotated entities:
- Condition: "thrombosis"
- Qualifier: "mesenteric veins"
- Qualifier: "portal veins"
- Qualifier: "hepatic veins"